Clinical trial exclusion criterion:
18. Any target lesion requires treatment with a device other than percutaneous transluminal coronary angioplasty (PTCA) prior to stent placement (e.g. but not limited to, directional coronary atherectomy, excimer laser, rotational atherectomy, etc.).

Annotated entities:
- Device: "device other than percutaneous transluminal coronary angioplasty (PTCA)"
- Procedure: "percutaneous transluminal coronary angioplasty (PTCA)"
- Negation: "other than"
- Procedure: "stent placement"
- Temporal: "prior to stent placement"
- Reference_point: "stent placement"
- Procedure: "directional coronary atherectomy"
- Procedure: "excimer laser"
- Procedure: "rotational atherectomy"
- Mood: "requires"
- Procedure: "treatment"
- Condition: "target lesion"